嬰幼兒出現喘鳴（stridor）最常見是什麼原因？
A. 聲帶麻痺（vocal fold paralysis）
B. 喉囊腫（laryngeal cyst）
C. 喉軟化症（laryngomalacia）
D. 聲門下阻塞（subglottic stenosis）

正確答案：C. 喉軟化症（laryngomalacia）